Severe hepatic dysfunction, defined as:

The above is a clinical trial exclusion criterion. Annotated with entity spans:
[Qualifier: Severe] [Condition: hepatic dysfunction], defined as: